resection must have been histologically complete in depth,

The above is a clinical trial inclusion criterion. Annotated with entity spans:
[Condition: resection] must have been [Procedure: histologically] [Qualifier: complete in depth],